Clinical trial exclusion criterion:
Facilities with a resident population with >=20% combative patients

Entity relations:
- AND("combative patients", "resident population")
- Has_value("resident population", ">=20%")